Clinical trial exclusion criterion:
Active pathological bleeding

Annotated entities:
- Temporal: "Active"
- Condition: "pathological bleeding"